丙酮酸脫氫酶複合物（pyruvate dehydrogenase complex）含有下列那些輔酶參與其催化反應？
A. thiamine pyrophosphate（TPP）、NAD+及硫辛酸（lipoic acid）
B. FAD、NAD+及生物素（biotin）
C. thiamine pyrophosphate（TPP）、FAD及輔酶Q（coenzyme Q）
D. thiamine pyrophosphate（TPP）、NAD+及生物素（biotin）

正確答案：A. thiamine pyrophosphate（TPP）、NAD+及硫辛酸（lipoic acid）